良性陣發性姿勢性眩暈（benign paroxysmal positional vertigo, BPPV）是橢圓囊或球囊中的耳石（otolith）脫落，掉入半規管中，耳石脫落最常見是掉入：
A. 側半規管（lateral semicircular canal）
B. 後半規管（posterior semicircular canal）
C. 上半規管（superior semicircular canal）
D. 水平半規管（horizontal semicircular canal）

正確答案：B. 後半規管（posterior semicircular canal）